Clinical trial exclusion criterion:
Spinal anesthesia or sciatic nerve block contraindicated

Entity relations:
- AND("contraindicated", "Spinal anesthesia")
- OR("Spinal anesthesia", "sciatic nerve block")